mental retardation or organic brain damage

The above is a clinical trial exclusion criterion. Annotated with entity spans:
[Condition: mental retardation] or [Condition: organic brain damage]